What is the origin of XUT transcripts in yeast?

XUTs are a class of Xrn1-sensitive antisense regulatory non-coding RNA in yeast.